Clinical trial exclusion criterion:
Renal function deficiency (GFR <30 ml/min/1.73m2)

Entity relations:
- Has_value("GFR", "<30 ml/min/1.73m2")
- Subsumes("Renal function deficiency", "GFR")